Clinical trial exclusion criterion:
History of ischemic heart disease or peripheral arterial disease or cerebrovascular disease

Annotated entities:
- Condition: "ischemic heart disease"
- Condition: "peripheral arterial disease"
- Condition: "cerebrovascular disease"